Clinical trial exclusion criterion:
Subjects were not to have participated in a previous clinical trial within 90 days prior to study initiation.

Annotated entities:
- Temporal: "90 days prior to study initiation"
- Observation: "participated in a previous clinical trial"
- Context_Error: "Subjects were not to have participated in a previous clinical trial within 90 days prior to study initiation."